De novo mutations in which novel genes are involved in systemic lupus erythematosus?

DNMT3A, PRKCD, and C1QTNF4.